你做腎臟超音波時發現兩邊腎臟皆為 12.5 公分長，而病人血中肌酸酐（creatinine）為 7.5 mg/dL，則應該懷疑那一種病？
A. 慢性腎小球腎炎（chronic glomerulonephritis）
B. 慢性間質性腎炎（chronic interstitial nephritis）
C. 糖尿病腎病變（DM nephropathy）
D. 高血壓性腎病變（hypertensive nephropathy）

正確答案：C. 糖尿病腎病變（DM nephropathy）